Uncontrolled diabetes defined as HbA1c above 70 mmol/mol and insufficient nutritional status.

The above is a clinical trial exclusion criterion. Annotated with entity spans:
[Condition: Uncontrolled diabetes] defined as [Measurement: HbA1c] [Value: above 70 mmol/mol] and [Condition: insufficient nutritional status].